Clinical trial inclusion criterion:
Male or female =18 years of age at Visit 1

Annotated entities:
- Person: "Male"
- Person: "female"
- Person: "age"
- Value: "=18 years"
- Temporal: "at Visit 1"
- Reference_point: "Visit 1"